Clinical trial exclusion criterion:
pregnancy and breast feeding mothers

Entity relations:
- OR("pregnancy", "breast feeding")